Clinical trial inclusion criterion:
6) no antidepressant medications or clinically able to discontinue medications,

Entity relations:
- Has_negation("antidepressant", "no")
- OR("antidepressant", "clinically able to discontinue medications")